下列那一種 T 細胞是成熟且具有輔助（helper T cell）的功能？
A. TCRγ:δ CD4-CD8+
B. TCRα:β CD4+CD8+
C. TCRα:β CD4+CD8-
D. TCRα:β CD4-CD8+

正確答案：C. TCRα:β CD4+CD8-